Una paciente de 70 años ingresa en UCI tras sufrir IAM anterior tratado mediante angioplastia coronaria y colocación de stent en la arteria descendente anterior. 4 días después presenta bruscamente hipotensión que obliga a aporte vigoroso de volumen, inicio de drogas vasoactivas, intubación orotraqueal y conexión a la ventilación mecánica. A la exploración física destaca un soplo no presente previamente. Ante la sospecha de complicación mecánica del infarto, se realiza ecocardiografía transtorácica que muestra derrame pericárdico. Señale la Respuesta CORRECTA:
1. La mortalidad con tratamiento médico es del 20%.
2. En caso de rotura de pared libre hay salto oximétrico en el ventrículo derecho en el cateterismo de Swan-Ganz.
3. En caso de rotura de pared libre no hay frémito palpable.
4. Las complicaciones mecánicas suelen aparecer en el primer día postinfarto.

Respuesta correcta: 3. En caso de rotura de pared libre no hay frémito palpable.